T2DM as defined by American Diabetes Association (ADA) criteria

The above is a clinical trial inclusion criterion. Annotated with entity spans:
[Condition: T2DM] as defined by [Qualifier: American Diabetes Association (ADA) criteria]